El receptor de células B está constituido por una inmunoglobulina de membrana asociada a moléculas de señalización que contienen elementos de activación (ITAM), denominadas:
1. Complejo CD3.
2. Ig-alfa e Ig-beta.
3. Cadenas lambda y kappa.
4. Cadenas mu y delta.

Respuesta correcta: 2. Ig-alfa e Ig-beta.